Sinoatrial block.

The above is a clinical trial exclusion criterion. Annotated with entity spans:
[Condition: Sinoatrial block].